El oxígeno de los éteres como el de los alcoholes puede protonarse para generar:
1. Iones iminio.
2. Iones alquiloxonio.
3. Peróxidos.
4. Piranos.
5. Enaminas.

Respuesta correcta: 2. Iones alquiloxonio.